下列何者是藥物 clearance 的單位？
A. ml
B. ml/min
C. mg/min
D. mg/ml/min

正確答案：B. ml/min